Uno de los estados de hipercoagulabilidad hereditario se debe a la alteración de unas de las siguientes proteínas, pero NO a la carencia de ella; ¿cuál?:
1. Factor V Leiden.
2. Antitrombina.
3. Proteína C.
4. Proteína S.

Respuesta correcta: 1. Factor V Leiden.